Subject previously enrolled to this study.

The above is a clinical trial exclusion criterion. Annotated with entity spans:
[Non-query-able: Subject previously enrolled to this study.]